Contraindication to neuraxial anesthesia

The above is a clinical trial exclusion criterion. Annotated with entity spans:
[Condition: Contraindication] to [Procedure: neuraxial anesthesia]